Clinical trial inclusion criterion:
Written informed consent obtained from the parent or guardian of the subject.

Entity relations:
- Has_qualifier("Written informed consent", "parent")
- OR("parent", "guardian")